Clinical trial exclusion criterion:
No febrile illnesses with temperature >39 degree celsius for more than five consecutive days within the week preceding the Screening Visit.

Entity relations:
- Has_value("temperature", ">39 degree celsius")
- Has_index("within the week preceding the Screening Visit", "the Screening Visit")
- AND("febrile illnesses", "temperature")
- Has_temporal("temperature", "for more than five consecutive days")
- Has_temporal("temperature", "within the week preceding the Screening Visit")
- Has_negation("febrile illnesses", "No")